La piridazina es un heterociclo aromático que contiene en su estructura:
1. Un nitrógeno.
2. Dos nitrógenos.
3. Tres nitrógenos.
4. Cuatro nitrógenos.
5. Ningún nitrógeno.

Respuesta correcta: 2. Dos nitrógenos.